下列有關肝腺瘤（hepatic adenoma）之敘述，何者錯誤？
A. 肝腺瘤與使用口服避孕藥相關
B. 確定診斷後可繼續服用避孕藥
C. 單一腺瘤通常位於右葉肝
D. 病理組織腺瘤係由正常形態之肝細胞增生而成

正確答案：B. 確定診斷後可繼續服用避孕藥